Clinical trial exclusion criterion:
Premenopausal women who are nursing or pregnant

Entity relations:
- OR("nursing", "pregnant")